Clinical trial exclusion criterion:
Mild Cognitive Impairment or Dementia

Annotated entities:
- Condition: "Mild Cognitive Impairment"
- Condition: "Dementia"